Any surgical or medical condition which might significantly alter the absorption, distribution, metabolism, or excretion of study drugs including, but not limited to, any of the following:

The above is a clinical trial exclusion criterion. Annotated with entity spans:
Any [Condition: surgical] or [Condition: medical condition] which might significantly [Qualifier: alter the absorption, distribution, metabolism, or excretion of study drugs] including, but not limited to, any of the following: